Clinical trial inclusion criterion:
No relapse of a previously unrecognized ALL

Entity relations:
- Has_negation("relapse", "No")
- Has_qualifier("ALL", "previously unrecognized")
- AND("relapse", "ALL")